Prior treatment with more than 6 cycles of traditional alkylating agent-based chemotherapy regimens

The above is a clinical trial exclusion criterion. Annotated with entity spans:
[Temporal: Prior] [Procedure: treatment] with [Value: more than 6 cycles] of traditional [Qualifier: alkylating agent-based] [Procedure: chemotherapy regimens]